Clinical trial inclusion criteria:
Scheduled for arthroscopic labral repair with or without osteoplasty of the hip.
18 to 50 years old
American Society of Anesthesiologists Physical Status (ASA PS) score of I or II.

Annotated entities:
- Procedure: "arthroscopic labral repair"
- Procedure: "osteoplasty"
- Qualifier: "hip"
- Mood: "Scheduled"
- Person: "old"
- Value: "18 to 50 years"
- Measurement: "American Society of Anesthesiologists Physical Status score"
- Measurement: "ASA PS"
- Value: "I or II"